Blood culture-proven typhoid fever (S. typhi or S. paratyphi)

The above is a clinical trial inclusion criterion. Annotated with entity spans:
[Measurement: Blood culture]-[Value: proven] [Condition: typhoid fever] ([Condition: S. typhi] or [Condition: S. paratyphi])